Legionella pneumophila se transmite por:
1. Sistemas de aire acondicionado.
2. Contacto entre individuos.
3. Picadura de mosquitos.
4. Alimentos contaminados.
5. Vía fecal-oral.

Respuesta correcta: 1. Sistemas de aire acondicionado.